克氏循環（TCA cycle）的中間產物可經由轉氨基作用（transamination）直接生成下列那兩種胺基酸？
A. 精胺酸（arginine）與組胺酸（histidine）
B. 酪胺酸（tyrosine）與脯胺酸（proline）
C. 麩胺酸（glutamate）與天冬胺酸（aspartate）
D. 丙胺酸（alanine）與絲胺酸（serine）

正確答案：C. 麩胺酸（glutamate）與天冬胺酸（aspartate）